Patient obtaining care in relation to a recently completed pregnancy (delivery, spontaneous or elective abortion)

The above is a clinical trial exclusion criterion. Annotated with entity spans:
[Non-query-able: Patient obtaining care in relation to a recently completed pregnancy (delivery, spontaneous or elective abortion)]